抗精神病藥物中，下列那一個是多巴胺部分作用劑（dopamine partial agonist）？
A. Amisulpride
B. Aripiprazole
C. Clozapine
D. Ziprasidone

正確答案：B. Aripiprazole